Las moléculas no proteicas que unidas a la parte proteica de la enzima constituyen la enzima completa se denominan:
1. Cofactores.
2. Iones metálicos.
3. Coenzimas.
4. Vitaminas.
5. Grupos prostéticos.

Respuesta correcta: 1. Cofactores.